Clinical trial exclusion criterion:
history of renal diseases, a coagulation abnormality, a hepatic disease, or drug abuse

Entity relations:
- Has_temporal("renal diseases", "history")
- OR("renal diseases", "drug abuse", "coagulation abnormality", "hepatic disease")